Clinical trial inclusion criterion:
Patient is receiving immunosuppressive therapy or has known immunosuppressive or autoimmune disease (e.g., human immunodeficiency virus, systemic lupus erythematous, etc.)

Annotated entities:
- Procedure: "immunosuppressive therapy"
- Condition: "immunosuppressive disease"
- Condition: "autoimmune disease"
- Condition: "human immunodeficiency virus"
- Condition: "systemic lupus erythematous"